Clinical trial exclusion criterion:
Contra-indications to muscle relaxants: 1) Concurrent use of centrally acting opioids; 2) Renal impairment; 3) Liver abnormality including cirrhosis or elevated enzymes 4) Use of any of the following medications: fluvoxamine, fluoroquinolones, amiodarone, mexiletine, propafenone, verapamil, cimetidine, famotidine, acyclovir, ticlopidine, oral contraceptive pills

Entity relations:
- Has_temporal("centrally acting opioids", "Concurrent")
- Subsumes("Liver abnormality", "cirrhosis")
- AND("Contra-indications", "muscle relaxants")
- Subsumes("Contra-indications", "centrally acting opioids")
- OR("cirrhosis", "elevated enzymes")
- OR("centrally acting opioids", "Liver abnormality", "fluvoxamine", "Renal impairment")
- OR("fluvoxamine", "ticlopidine", "acyclovir", "famotidine", "cimetidine", "verapamil", "propafenone", "mexiletine", "amiodarone", "fluoroquinolones", "oral contraceptive pills")